Clinical trial exclusion criterion:
Bleeding disorder

Annotated entities:
- Condition: "Bleeding disorder"